下列何者不會造成血清低離子間隙（low anion gap）？
A. 鋰鹽中毒（Lithium intoxication）
B. 腎病症候群（Nephrotic syndrome）
C. 高血磷症（Hyperphosphatemia）
D. 高血脂（Hyperlipidemia）

正確答案：C. 高血磷症（Hyperphosphatemia）